Clinical trial exclusion criterion:
QTc >500 milliseconds on EKG at screening.

Annotated entities:
- Measurement: "QTc"
- Value: ">500 milliseconds"
- Temporal: "at screening"
- Reference_point: "screening"
- Procedure: "EKG"